鼻腔的嗅覺區（olfactory region）不具下列那一種細胞？
A. 雙極神經元（bipolar neuron）
B. 杯狀細胞（goblet cell）
C. 基底細胞（basal cell）
D. 支持細胞（sustentacular cell）

正確答案：B. 杯狀細胞（goblet cell）